Clinical trial exclusion criterion:
History of a positive Hepatitis B surface antigen (HBsAg) or Hepatitis C test result.

Annotated entities:
- Temporal: "History"
- Measurement: "Hepatitis B surface antigen (HBsAg) test"
- Measurement: "Hepatitis C test"
- Value: "positive"